Clinical trial exclusion criterion:
Significant liver disease

Entity relations:
- Has_qualifier("liver disease", "Significant")